Exclusion for monitoring difficulties (mutation, insufficient motivation, priority associated pathology in care)

The above is a clinical trial exclusion criterion. Annotated with entity spans:
[Non-representable: Exclusion for monitoring difficulties (mutation, insufficient motivation, priority associated pathology in care)]